Clinical trial exclusion criterion:
Cervical dilatation > 4 cm

Entity relations:
- Has_value("Cervical dilatation", "> 4 cm")